Clinical trial exclusion criterion:
Cerclage in situ

Annotated entities:
- Condition: "Cerclage in situ"